Clinical trial inclusion criterion:
ischemic cardiomyopathy with or without previous myocardial infarction or

Entity relations:
- Has_temporal("myocardial infarction", "previous")